Clinical trial exclusion criterion:
2. Abnormal and clinically relevant ECG tracing. 6. Donation or loss of a significant volume of blood or plasma (> 450 mL) within 28 days prior to the initial dose of study medication.

Annotated entities:
- Parsing_Error: "2."
- Condition: "Abnormal ECG tracing"
- Subjective_judgement: "clinically relevant"
- Parsing_Error: "6."
- Non-query-able: "Donation or loss of a significant volume of blood or plasma (> 450 mL) within 28 days prior to the initial dose of study medication."